尿毒症病患可能合併發生貧血，請問此類病患需要何種造血生長激素之治療？
A. Thrombopoietin
B. Erythropoietin
C. Stem cell factor
D. Granulocyte-colony stimulating factors

正確答案：B. Erythropoietin